Clinical trial exclusion criterion:
Patients with a history of gastric bypass surgery.

Annotated entities:
- Procedure: "gastric bypass surgery"